High risk of bleeding

The above is a clinical trial exclusion criterion. Annotated with entity spans:
[Qualifier: High risk] of [Condition: bleeding]